What is the function of BRD4?

Our recent study revealed that autophagy programs are transcriptionally suppressed by the BET family protein BRD4.